Se han desarrollado tratamientos eficaces basados en el “mecanismo de ejecución conductual” para:
1. La esquizofrenia.
2. La hipocondría.
3. El trastorno por déficit de atención con hiperactividad.
4. El juego patológico.

Respuesta correcta: 4. El juego patológico.